What type of mutation is causing the industrial melanism phenotype in peppered moths?

The mutation event giving rise to industrial melanism in Britain was the insertion of a large, tandemly repeated, transposable element into the first intron of the gene cortex.